Injection drug users with a fever

The above is a clinical trial exclusion criterion. Annotated with entity spans:
Injection [Person: drug users] with a [Condition: fever]